¿Qué factores/variables diferenciales en la infancia determinan la evaluación infantil?
1. Diversidad y heterogeneidad de problemas psicológicos.
2. Disparidad de la información proporcionada por distintas fuentes consultadas (padres, profesores, etc.).
3. Influencia del sexo y edad en la aparición de los problemas infantiles.
4. Escasez de instrumentos y técnicas de evaluación sensibles a las características del niño.
5. Carácter evolutivo del menor, plasticidad infantil que hace al niño sensible a las influencias del entorno e interpretación por parte de los adultos del problema a evaluar.

Respuesta correcta: 5. Carácter evolutivo del menor, plasticidad infantil que hace al niño sensible a las influencias del entorno e interpretación por parte de los adultos del problema a evaluar.